Clinical trial exclusion criterion:
Non perforated corneal ulcer

Entity relations:
- Has_qualifier("corneal ulcer", "Non perforated")